Pathological fetal heart rate pattern (cardiotocogram, CTG) before Syntocinon® initiation

The above is a clinical trial exclusion criterion. Annotated with entity spans:
[Condition: Pathological fetal heart rate pattern] ([Procedure: cardiotocogram], [Procedure: CTG]) [Temporal: before Syntocinon® initiation]